下列何者非開放性動脈導管（patent ductus arteriosus）的診斷要件？
A. 連續性心雜音（continuous murmur）
B. 右心室肥厚
C. 胸部 X 光肺動脈陰影增大
D. 胸部 X 光顯示肺血流增加

正確答案：B. 右心室肥厚